Clinical trial exclusion criterion:
Known upper gastrointestinal malignancy

Annotated entities:
- Condition: "upper gastrointestinal malignancy"